37+0 - 42+0 weeks of gestation

The above is a clinical trial inclusion criterion. Annotated with entity spans:
[Value: 37+0] - [Value: 42+0] [Measurement: weeks of gestation]